weight <50kg or BMI =35 kg/m2

The above is a clinical trial exclusion criterion. Annotated with entity spans:
[Measurement: weight] [Value: <50kg] or [Measurement: BMI] [Value: =35 kg/m2]